Clinical trial inclusion criterion:
Patients with functional dyspepsia that fulfill Rome III criteria with inadequate relief of dyspeptic symptoms

Annotated entities:
- Condition: "functional dyspepsia"
- Qualifier: "Rome III criteria"
- Qualifier: "inadequate relief"
- Condition: "dyspeptic symptoms"